Clinical trial inclusion criterion:
fluent in English or Spanish

Annotated entities:
- Observation: "fluent in English"
- Observation: "fluent in Spanish"